Which syndromes are caused by LAMA1 mutations?

Poretti–Boltshauser syndrome, Joubert syndrome